下列何者為非自體免疫疾病？
A. systemic lupus erythematosus
B. Hashimoto's thyroiditis
C. type I diabetes mellitus
D. chronic allergic rhinitis

正確答案：D. chronic allergic rhinitis